Clinical trial inclusion criteria:
male and female patients over the age of 18 years.
written informed consent (approved by the Institutional Review Board [IRB]/Independent Ethics Committee [IEC]) obtained prior to any study specific procedures.
patient with mild to severe carotid artery disease

Annotated entities:
- Person: "male"
- Person: "female"
- Value: "over 18 years"
- Person: "age"
- Non-query-able: "written informed consent"
- Condition: "carotid artery disease"
- Qualifier: "severe"
- Qualifier: "mild"